Clinical trial inclusion criterion:
Subjects undergoing burn excision surgery for standard of care purposes

Annotated entities:
- Procedure: "burn excision surgery"
- Temporal: "undergoing"